Clinical trial exclusion criterion:
Severe liver disease

Annotated entities:
- Qualifier: "Severe"
- Condition: "liver disease"